食道癌中之 squamous cell carcinoma 最常出現於食道何部位？
A. 頸部食道
B. 胸部上段食道
C. 胸部中段食道
D. 胸部下段食道

正確答案：C. 胸部中段食道